有關睪丸腫瘤之敘述，下列何者錯誤？
A. 睪丸惡性腫瘤最常見者為germ cell tumor
B. 續發性睪丸惡性腫瘤最常見為lymphoma
C. α-胎兒蛋白（AFP）於pure seminoma不會升高
D. 早期seminoma之治療以化療為主

正確答案：D. 早期seminoma之治療以化療為主